Clinical trial inclusion criterion:
18-85 years of age, inclusive;

Entity relations:
- Has_value("age", "18-85 years , inclusive")